Clinical trial exclusion criterion:
Subjects who are diagnosed as suffering from psychotic illness according to DSM-IV (Axis 1)22, or with a history of CNS disease, a history of infection that might affect CNS (HIV, syphilis, cytomegalovirus, herpes), or a history of head injury with loss of consciousness,pregnant women.

Entity relations:
- Subsumes("psychotic illness", "DSM-IV")
- Has_qualifier("DSM-IV", "Axis 1")
- AND("history", "CNS disease")
- Has_qualifier("infection", "affect CNS")
- Subsumes("infection", "HIV")
- AND("history", "head injury")
- AND("head injury", "loss of consciousness")
- AND("history", "infection")
- OR("HIV", "syphilis", "cytomegalovirus", "herpes")
- OR("psychotic illness", "history", "history", "pregnant", "history")